Para calcular el número de genotipos distintos en cualquier serie alélica se aplica la fórmula:
1. (n-1)/2.
2. n x (n+1)/2.
3. n x (n-1)/2.
4. (n-1) x (n+1)/2.
5. (2n-1)/2.

Respuesta correcta: 2. n x (n+1)/2.